Entre las competencias a desarrollar por la enfermera de salud mental dentro del equipo multidisciplinar, se encuentra:
1. Colaborar en la formulación del diagnóstico médico del trastorno mental.
2. Realizar, excepcionalmente, actividades de investigación e innovación.
3. Promover, en el menor tiempo posible, la institucionalización del paciente.
4. Intervenir en la promoción y prevención de la salud mental.
5. Practicar una enfermería experiencial basada en la observación de los signos y síntomas de la enfermedad mental.

Respuesta correcta: 4. Intervenir en la promoción y prevención de la salud mental.